Clinical trial inclusion criteria:
ASA classification II or III females
Age: 18-45 years old
BMI = 50 kg/m2
Singleton pregnancy
Simple prophylactic cervical cerclage
Planning neuraxial anesthesia

Annotated entities:
- Measurement: "ASA classification"
- Value: "II or III"
- Person: "females"
- Person: "Age"
- Value: "18-45 years old"
- Measurement: "BMI"
- Value: "= 50 kg/m2"
- Condition: "Singleton pregnancy"
- Qualifier: "prophylactic"
- Qualifier: "Simple"
- Procedure: "cervical cerclage"
- Procedure: "neuraxial anesthesia"
- Mood: "Planning"